chronic use of pain medication

The above is a clinical trial exclusion criterion. Annotated with entity spans:
[Multiplier: chronic use] of [Drug: pain medication]